自然殺手細胞（Natural killer cell）與 T 淋巴球共同具有下列何種細胞表面標記？
A. CD2
B. CD3
C. CD4
D. CD8

正確答案：A. CD2